Clinical trial inclusion criterion:
Requires VTE thromboprophylaxis

Annotated entities:
- Condition: "VTE"
- Procedure: "thromboprophylaxis"